Patients who received chemotherapy less than 6 weeks ago.

The above is a clinical trial exclusion criterion. Annotated with entity spans:
Patients who received [Procedure: chemotherapy] [Temporal: less than 6 weeks ago].